At least one site of measurable disease on CT/MRI scans as defined by RECIST 1.1. Baseline imaging must be performed within 30 days of dosing.

The above is a clinical trial inclusion criterion. Annotated with entity spans:
At least one site of [Condition: measurable disease] on [Procedure: CT]/[Procedure: MRI scans] as defined by RECIST 1.1. [Temporal: Baseline] [Procedure: imaging] must be performed [Temporal: within 30 days of dosing].